下列關於自殺的敘述，何者正確？ ①自殺死亡比率，女性大於男性 ②隨著年紀增加，自殺率逐漸下降 ③情緒疾患、精神分裂症、酒癮的病人，其自殺風險皆高 ④企圖自殺者中，約 45%～80% 有情緒疾患問題 ⑤焦慮疾患與自殺並沒有關聯性
A. ①④⑤
B. ①③④
C. ②③⑤
D. ③④

正確答案：D. ③④